有關Warthin tumor的描述，何者錯誤？
A. 是唾腺腫瘤中第二常見之良性腫瘤
B. 多發生於較年長有吸菸習慣之男性
C. 好發位置為腮腺之上端
D. 腮腺淺葉切除術是適當的治療方式

正確答案：C. 好發位置為腮腺之上端